Clinical trial exclusion criterion:
Patients receiving prednisone = 1mg/kg/d for the treatment of acute GVHD or mild, severe chronic GVHD.

Entity relations:
- Has_value("prednisone", "= 1mg/kg/d")
- Has_qualifier("GVHD", "chronic")
- Has_qualifier("GVHD", "mild")
- OR("mild", "severe")
- OR("acute GVHD", "GVHD")